La tasa de filtración glomerular en la nefrona aumenta si:
1. Disminuye la presión hidrostática en los capilares glomerulares.
2. Aumenta la presión osmótica en los capilares glomerulares.
3. Disminuye la presión hidrostática en la cápsula de Bowman.
4. Aumenta la resistencia en la arteriola aferente.

Respuesta correcta: 3. Disminuye la presión hidrostática en la cápsula de Bowman.